一位55歲男性，有糖尿病病史，發生胸悶症狀約5小時來到急診，血壓140/100 mmHg，心跳每分鐘80次，經抽血及心電圖診斷為ST節段上升之心肌梗塞（ST-segment elevation myocardial infarction），有關此患者的 治療，下列敘述何者錯誤？
A. 鈣離子阻斷劑在急性期可以緩解病患的症狀，特別是短效dihydropyridines類的鈣離子阻斷劑
B. 如果沒有絕對禁忌症，應給予aspirin 160～325 mg
C. 如果沒有禁忌症（如低血壓或曾服用phosphodiesterase-5 inhibitor），可以嘗試使用舌下含片nitroglycerin 來緩解病患的症狀
D. 如果沒有禁忌症，可給予靜脈注射或者口服的乙型交感神經阻斷劑（β-blockers）

正確答案：A. 鈣離子阻斷劑在急性期可以緩解病患的症狀，特別是短效dihydropyridines類的鈣離子阻斷劑